Contraindication for ketamine infusion

The above is a clinical trial exclusion criterion. Annotated with entity spans:
[Condition: Contraindication] for [Procedure: ketamine infusion]